Los grados de libertad de la varianza intragrupos en una Anova de 1 vía en el que se comparan 4 grupos de 10 individuos cada uno son:
1. 38.
2. 39
3. 3.
4. 40.
5. 36.

Respuesta correcta: 5. 36.